一名 15 歲女性，前頸部正中央線上方處有一個腫塊存在，腫塊的大小並沒有明顯改變。她接受腫塊切除手術。顯微鏡下檢查發現這是一個有上皮覆蓋的囊腫。下列何者是最可能的診斷？
A. 腮裂囊腫（branchial cyst）
B. 皮樣囊腫（dermoid cyst）
C. 甲狀舌管囊腫（thyroglossal duct cyst）
D. 腺樣囊狀癌（adenoid cystic carcinoma）

正確答案：C. 甲狀舌管囊腫（thyroglossal duct cyst）